Clinical trial inclusion criterion:
Stable with < 20 mg prednisone (or equivalent) qd

Entity relations:
- Has_multiplier("prednisone", "< 20 mg qd")